Clinical trial exclusion criterion:
Multiple gestation

Annotated entities:
- Condition: "Multiple gestation"